Willingness to eat a chocolate-flavored snack at test sessions and two week training period

The above is a clinical trial inclusion criterion. Annotated with entity spans:
[Observation: Willingness to eat a chocolate-flavored snack] [Temporal: at test sessions] and two week training period